有關食道閉鎖併遠端氣管食道瘻管（esophageal atresia with distal tracheoesophageal fistula）的手術，下列敘述何項錯誤？
A. 瘻管的結紮（ligation），最好在氣管與食道瘻管黏膜之交界處
B. 上端的食道可剝離一段長距離，以便吻合
C. 下端的食道可剝離一段長距離，以便吻合
D. 一般是經由胸腔外（extrapleural）手術

正確答案：C. 下端的食道可剝離一段長距離，以便吻合